Clinical trial exclusion criterion:
History of autoimmune hepatitis

Annotated entities:
- Condition: "autoimmune hepatitis"